有關動脈粥狀硬化形成過程中的 fatty streak 的敘述，何者錯誤？
A. 是可逆性的病變
B. 在任何年齡皆可能發生
C. 會造成血管腔的狹窄
D. 組織學上可看到泡沫細胞（foam cell）

正確答案：C. 會造成血管腔的狹窄